Clinical trial exclusion criterion:
Subjects with any condition that as judged by the Investigator would place the subject at increased risk of harm if he/she participated in the study.

Annotated entities:
- Non-query-able: "Subjects with any condition that as judged by the Investigator would place the subject at increased risk of harm if he/she participated in the study"